Clinical trial exclusion criterion:
Primary diagnosis of MDD with psychotic feature, bipolar disorder, schizophrenia, schizoaffective disorder, other psychotic disorder or anxiety disorder, a history of alcohol/ drug abuse within the past 12 months, or a diagnosis of dementia

Annotated entities:
- Condition: "MDD"
- Condition: "psychotic feature"
- Condition: "bipolar disorder"
- Condition: "schizophrenia"
- Condition: "schizoaffective disorder"
- Condition: "psychotic disorder"
- Qualifier: "other"
- Condition: "anxiety disorder,"
- Condition: "drug abuse"
- Condition: "alcohol abuse"
- Temporal: "within the past 12 months"
- Condition: "dementia"